Clinical trial exclusion criterion:
Traumatic pulmonary contusion or laceration

Entity relations:
- Has_qualifier("pulmonary contusion", "Traumatic")
- OR("pulmonary contusion", "laceration")